Señale cuál de las siguientes manifestaciones clínicas NO son propias de la deshidratación en el lactante:
1. Pérdida de peso.
2. Fontanela hundida.
3. Sequedad de mucosas.
4. Hipotensión.
5. Bradicardia.

Respuesta correcta: 5. Bradicardia.